History of allergic reaction to study medications

The above is a clinical trial exclusion criterion. Annotated with entity spans:
[Non-query-able: History of allergic reaction to study medications]